Clinical trial inclusion criterion:
Post-operative complication of an act of neurosurgery or programmed neuroradiology

Annotated entities:
- Condition: "Post-operative complication"
- Procedure: "neurosurgery"
- Qualifier: "of an act of neurosurgery"
- Procedure: "neuroradiology"
- Qualifier: "of an act of programmed neuroradiology"